Hombre de 78 años de edad al que se realizó cateterismo cardiaco con revascularización de la arteria coronaria derecha hace 3 semanas y que consulta por náuseas y vómitos de 3 días de evolución. Presenta presión arterial de 185/85 mm Hg y lesiones purpúreas en los dedos de ambos pies. En la analítica se objetiva urea 230 mg/dL y creatinina 5.8 mg/dL. ¿Cuál es el diagnóstico más probable?
1. Hipertensión arterial maligna.
2. Necrosis tubular aguda por contraste.
3. Insuficiencia renal rápidamente progresiva.
4. Enfermedad ateroembólica renal.
5. Estenosis de arteria renal bilateral.

Respuesta correcta: 4. Enfermedad ateroembólica renal.